Contraindications to therapy with the study drug or hypersensitivity to the study drug (active ingredient or excipients of the formulation).

The above is a clinical trial exclusion criterion. Annotated with entity spans:
[Post-eligibility: Contraindications to therapy with the study drug or hypersensitivity to the study drug (active ingredient or excipients of the formulation).]